Clinical trial exclusion criterion:
Any surgical or medical condition which might significantly alter the absorption, distribution, metabolism, or excretion of study drugs including, but not limited to, any of the following:

Entity relations:
- Has_qualifier("surgical condition", "alter the absorption, distribution, metabolism, or excretion of study drugs")
- OR("surgical condition", "medical condition")